Clinical trial exclusion criterion:
Digital Sympathectomy or botulinum toxin injection planned in the following month.

Entity relations:
- Has_mood("Digital Sympathectomy", "planned")
- Has_temporal("Digital Sympathectomy", "in the following month")
- OR("Digital Sympathectomy", "botulinum toxin injection")